5. New York Heart Association (NYHA) Class II or higher congestive heart failure.

The above is a clinical trial exclusion criterion. Annotated with entity spans:
[Parsing_Error: 5.] [Measurement: New York Heart Association (NYHA)] [Value: Class II or higher] [Condition: congestive heart failure].